Clinical trial inclusion criterion:
Patients with chronic heart failure of New York Heart Association Class II or III, a left ventricular ejection fraction of = 40% for patients in NYHA class II or = 45% for patients in NYHA class III, a hemoglobin level at the screening visit between 9.5-13.5 g/dl, and iron deficiency, which is defined as serum ferritin level < 100µg/l or between 100 and 299 µg/l, when transferring saturation is < 20%.

Annotated entities:
- Condition: "chronic heart failure"
- Measurement: "New York Heart Association"
- Value: "Class II or III"
- Measurement: "left ventricular ejection fraction"
- Value: "= 40%"
- Measurement: "NYHA"
- Value: "class II"
- Measurement: "NYHA"
- Value: "class III"
- Value: "= 45%"
- Measurement: "hemoglobin level"
- Temporal: "at the screening visit"
- Reference_point: "the screening visit"
- Value: "between 9.5-13.5 g/dl"
- Condition: "iron deficiency"
- Measurement: "serum ferritin level"
- Value: "< 100µg/l"
- Value: "between 100 and 299 µg/l"
- Measurement: "transferring saturation"
- Value: "< 20%"